Clinical trial exclusion criterion:
Evidence of neoplastic diseases of the liver

Annotated entities:
- Condition: "neoplastic diseases"
- Mood: "Evidence of"
- Qualifier: "liver"